Clinical trial exclusion criterion:
The patients are pregnant or lactational, or they refuse to practice contraception during the whole trial.

Entity relations:
- Has_negation("contraception", "refuse to practice")
- Has_temporal("contraception", "during the whole trial")
- OR("pregnant", "contraception", "lactational")